Residual clinically or radiographically evident tumor, including primary cutaneous and mucosal melanomas

The above is a clinical trial inclusion criterion. Annotated with entity spans:
[Qualifier: Residual] [Procedure: clinically] or [Procedure: radiographically] [Value: evident] [Condition: tumor], including [Condition: primary cutaneous] and [Condition: mucosal melanomas]